Clinical trial inclusion criterion:
18 years old or older.

Annotated entities:
- Person: "old"
- Value: "18 years or older"